Clinical trial exclusion criterion:
Current or past history of psychosis

Annotated entities:
- Temporal: "Current"
- Temporal: "past"
- Temporal: "history"
- Condition: "psychosis"